Clinical trial inclusion criterion:
Patient must not have had a corticosteroid injection in the SI joint within the last three months

Annotated entities:
- Negation: "not"
- Procedure: "corticosteroid injection"
- Qualifier: "SI joint"
- Temporal: "within the last three months"